針對嘔吐導致急性腎損傷的病人，欲區分prerenal或intrinsic病因，下列何項指標最為適合？
A. fractional excretion of sodium
B. urine-to-plasma urea ratio
C. fractional excretion of chloride
D. urine osmolality

正確答案：C. fractional excretion of chloride